Clinical trial inclusion criteria:
Supracondylar fracture
Age 2-17 years
American Society of Anesthesiologists Status 1 -3
Scheduled for closed reduction with percutaneous pinning under general anesthesia

Annotated entities:
- Condition: "Supracondylar fracture"
- Person: "Age"
- Value: "2-17 years"
- Measurement: "American Society of Anesthesiologists Status"
- Value: "1 -3"
- Procedure: "closed reduction with percutaneous pinning"
- Procedure: "general anesthesia"
- Mood: "Scheduled for"